Women are post-menopausal (defined as at least 1 year post cessation of menses) and aged = 45 and = 70 years. Males are aged = 40 years and = 70 years. Patients should have suitable veins for cannulation or repeated venipuncture.

The above is a clinical trial inclusion criterion. Annotated with entity spans:
[Person: Women] are [Condition: post-menopausal] (defined [Temporal: as at least 1 year post cessation of menses]) and [Person: aged] [Value: = 45 and = 70 years]. [Person: Males] are [Person: aged] [Value: = 40 years and = 70 years]. [Non-representable: Patients should have suitable veins for cannulation or repeated venipuncture.]